Subjects who have received RBC transfusions cannot have >15% adult hemoglobin

The above is a clinical trial exclusion criterion. Annotated with entity spans:
Subjects who have received [Procedure: RBC transfusions] [Negation: cannot have] [Value: >15% adult hemoglobin]